Clinical trial exclusion criterion:
Severe neurological disorder leading to immobility or confined to a wheelchair

Annotated entities:
- Condition: "neurological disorder"
- Qualifier: "Severe"
- Observation: "immobility"
- Device: "wheelchair"